Clinical trial inclusion criterion:
Patients receiving opioids and other concomitant pain medications should have a stable dose for the last 15 days.

Entity relations:
- Has_qualifier("pain medications", "other")
- Has_temporal("stable dose", "for the last 15 days")
- Has_qualifier("opioids", "stable dose")
- OR("opioids", "pain medications")